Clinical trial inclusion criterion:
Subject is able and willing to give informed consent.

Annotated entities:
- Informed_consent: "Subject is able and willing to give informed consent"